下列何種藥物不是血小板凝集之拮抗劑？
A. dipyridamole
B. aspirin
C. heparin
D. ticlopidine

正確答案：C. heparin